Clinical trial inclusion criterion:
Metabolic Syndrome (ATP III)

Annotated entities:
- Condition: "Metabolic Syndrome"
- Measurement: "ATP"
- Value: "III"